Valvular cardiac surgical/percutaneous procedure (i.e., ventriculotomy, atriotomy, and valve repair or replacement and presence of a prosthetic valve)

The above is a clinical trial exclusion criterion. Annotated with entity spans:
[Procedure: Valvular cardiac surgical]/percutaneous procedure (i.e., [Procedure: ventriculotomy], [Procedure: atriotomy], and [Procedure: valve repair] or replacement and presence of a [Device: prosthetic valve])